BMI>40

The above is a clinical trial exclusion criterion. Annotated with entity spans:
[Measurement: BMI][Value: >40]